肝臟的裸區（bare area）位於其：
A. 橫膈面（diaphragmatic surface）
B. 脾壓跡（splenic impression）
C. 肋骨壓跡（costal impression）
D. 腎壓跡（renal impression）

正確答案：A. 橫膈面（diaphragmatic surface）